What is Quorum Sensing in bacteria?

In many pathogenic microorganisms, communication systems, collectively termed quorum sensing (QS),